El llamado receptor poli-Ig:
1. Facilita el transporte de IgA a través del epitelio de las mucosas.
2. Media el transporte de IgG a través de la placenta.
3. Estabiliza la estructura polimérica de una IgM.
4. Se expresa en la superficie de los linfocitos B.
5. Se expresa en la superficie de los macrófagos tisulares.

Respuesta correcta: 1. Facilita el transporte de IgA a través del epitelio de las mucosas.